Las reacciones que usan sales de cobre (I) como reactivos para sustituir el nitrógeno de las sales de diazonio se llaman reacciones de:
1. Sandmeyer.
2. Chichibabin.
3. Peterson.
4. Gabriel.
5. Diels-Alder.

Respuesta correcta: 1. Sandmeyer.